下列何者的分泌物最不可能流經過半月裂孔（hiatus semilunaris）？
A. 額竇（frontal sinus）
B. 前篩竇（anterior ethmoidal sinus）
C. 上頜竇（maxillary sinus）
D. 蝶竇（sphenoid sinus）

正確答案：D. 蝶竇（sphenoid sinus）